Clinical trial inclusion criterion:
Diabetes mellitus

Annotated entities:
- Condition: "Diabetes mellitus"